內斜視（esotropia）常與下列何種屈光異常有關？
A. 近視眼
B. 遠視眼
C. 老視眼（presbyopia）
D. 散光（astigmatism）

正確答案：B. 遠視眼